Clinical trial inclusion criterion:
Location of distal biliary obstruction is such that it would allow the proximal end of a stent to be positioned at least 2cm from the hilum

Annotated entities:
- Condition: "distal biliary obstruction"
- Procedure: "stent"
- Mood: "would allow"
- Qualifier: "at least 2cm from the hilum"